What is the chromosomal location of the LDL receptor gene associated with autosomal dominant Familial Hypercholesterolemia?

Mutations in the LDLr gene (LDLR), which is located on chromosome 19, cause familial hypercholesterolemia